Clinical trial exclusion criterion:
Current haemodialysis or peritoneal dialysis

Annotated entities:
- Procedure: "haemodialysis"
- Procedure: "peritoneal dialysis"
- Temporal: "Current"